50歲男性，整脊後不適至急診，腦部磁振照影顯示有右側延腦內側梗塞（infarction of right medial medulla），可能有那些症狀表現：①右側臉麻 ②左側肢體無力 ③右側肢體失調 （dysmetria） ④右側舌頭無力
A. ①③
B. ②④
C. ①④
D. ②③

正確答案：B. ②④